Clinical trial exclusion criterion:
Subject has severe arterial insufficiency of the legs (Screening on physical examination= patients with diminution or absence of dorsalis pedis or posterior tibialis pulses. If diminished or absent by palpation, then an arterial ultrasound is required with vascular plethysmography. If the absolute arterial pressure is below 50mm of Hg at the calf or ankle level, then the patient is to be excluded) or other peripheral vascular disease).

Annotated entities:
- Qualifier: "severe"
- Condition: "arterial insufficiency"
- Qualifier: "legs"
- Condition: "diminution or absence of dorsalis pedis"
- Condition: "diminution or absence of posterior tibialis pulses"
- Procedure: "arterial ultrasound"
- Procedure: "vascular plethysmography"
- Measurement: "absolute arterial pressure"
- Value: "below 50mm of Hg"
- Qualifier: "calf level"
- Qualifier: "ankle level"
- Procedure: "palpation"
- Observation: "diminished"
- Observation: "absent"
- Condition: "peripheral vascular disease"
- Procedure: "Screening on physical examination"
- Negation: "excluded"